上眼皮無法完全張開，不可能是下列何種疾病？
A. 第七條腦神經麻痺
B. 霍納症候群（Horner syndrome）
C. 第三條腦神經麻痺
D. 重症肌無力（myasthenia gravis）

正確答案：A. 第七條腦神經麻痺